Clinical trial exclusion criterion:
History of active substance abuse (including alcohol > 40g/day) within the past 2 years.

Entity relations:
- Has_qualifier("substance abuse", "active")
- Has_temporal("substance abuse", "History")
- Has_value("alcohol", "> 40g/day")
- Subsumes("substance abuse", "alcohol")
- Has_temporal("substance abuse", "within the past 2 years")